Clinical trial exclusion criterion:
Inability to consent/refusal Allergy to any of the study medications Multiple traumatic injuries Contraindication to neuraxial or general anesthesia Pregnancy

Entity relations:
- AND("Allergy", "study medications")
- OR("Inability to consent", "refusal")
- OR("neuraxial anesthesia", "general anesthesia")